下列何者為皮膚角質層主要的脂質成分，且缺少時，與異位性皮膚炎的發生有關？
A. cholesterol
B. ceramide
C. free fatty acid
D. triglyceride

正確答案：B. ceramide